Clinical trial exclusion criterion:
Use of an investigational drug within 30 days of randomization, or within 5 half-lives of the investigational drug (the longer period will apply)

Entity relations:
- Has_index("within 30 days of randomization", "randomization")
- multi("within 5 half-lives of the investigational drug", "investigational drug")
- Has_temporal("investigational drug", "within 30 days of randomization")
- OR("within 30 days of randomization", "within 5 half-lives of the investigational drug")